對於先天性小兒下肢缺損的患者，什麼年紀是開始裝配義肢的最適當時機？
A. 6至8個月
B. 9至12個月
C. 13至18個月
D. 19至24個月

正確答案：B. 9至12個月